Clinical trial inclusion criterion:
Female at birth and identifies as female gender

Entity relations:
- Has_index("at birth", "birth")
- Has_value("gender", "female")
- Has_temporal("Female", "at birth")